Clinical trial exclusion criterion:
Vulnerable patient populations including prisoners and institutionalized individuals.

Annotated entities:
- Person: "prisoners"
- Visit: "institutionalized"